BMI > 30 kg.m-2,

The above is a clinical trial exclusion criterion. Annotated with entity spans:
[Measurement: BMI] [Value: > 30 kg.m-2],